10. Disseminated intravascular coagulation (DIC) (diagnosis by laboratory or clinical assessment)

The above is a clinical trial exclusion criterion. Annotated with entity spans:
10. [Condition: Disseminated intravascular coagulation (DIC)] (diagnosis by laboratory or clinical assessment)